Clinical trial exclusion criterion:
Antiemetic drug use in the 24 hours prior to cesarean delivery,

Annotated entities:
- Drug: "Antiemetic drug"
- Temporal: "in the 24 hours prior to cesarean delivery"
- Reference_point: "cesarean delivery"
- Procedure: "cesarean delivery"